Clinical trial exclusion criteria:
congenital or valvular cardiomyopathy;
ischemic heart disease;
endocrine diseases: male hypogonadism, hyperthyroidism, adrenal diseases, pituitary diseases
proliferative retinopathy or autonomic neuropathy;
contraindications to sildenafil use or CMR imaging;

Annotated entities:
- Qualifier: "valvular"
- Qualifier: "congenital"
- Condition: "cardiomyopathy"
- Condition: "ischemic heart disease"
- Condition: "endocrine diseases"
- Condition: "male hypogonadism"
- Condition: "hyperthyroidism"
- Condition: "adrenal diseases"
- Condition: "pituitary diseases"
- Condition: "proliferative retinopathy"
- Condition: "autonomic neuropathy"
- Condition: "contraindications"
- Drug: "sildenafil"
- Procedure: "CMR imaging"